Clinical trial inclusion criterion:
4. Viable, granulating wound (investigator discretion)

Entity relations:
- Has_qualifier("wound", "granulating")
- Has_qualifier("wound", "Viable")
- AND("wound", "investigator discretion")